Which protein is involved in the organization and regulation of pluripotency-associated three-dimensional enhancer networks?

KLF4 is involved in the organization and regulation of pluripotency-associated three-dimensional enhancer networks. How transcription factors orchestrate the complex molecular changes around their target gene loci remains incompletely understood.